下列何種免疫抑制劑亦可用於冠狀動脈支架之包覆，藉其抑制細胞增生作用來防治術後冠狀動脈之再狹窄 （restenosis）？
A. cyclosporine
B. tacrolimus（FK 506）
C. sirolimus（rapamycin）
D. azathioprine

正確答案：C. sirolimus（rapamycin）